History of violence within 6 months prior to study entry

The above is a clinical trial exclusion criterion. Annotated with entity spans:
[Temporal: History] of [Observation: violence] [Temporal: within 6 months prior] to study entry